Clinical trial exclusion criterion:
Myocardial infarct, cerebrovascular accident, sepsis, respiratory failure, or severe intercurrent illness within the previous 6 weeks

Annotated entities:
- Condition: "Myocardial infarct"
- Condition: "cerebrovascular accident"
- Condition: "sepsis"
- Condition: "respiratory failure"
- Qualifier: "severe"
- Condition: "intercurrent illness"
- Temporal: "within the previous 6 weeks"